Clinical trial inclusion criterion:
Male & female patients >= 18 and < 70 years of age

Annotated entities:
- Person: "Male"
- Person: "female"
- Value: ">= 18 and < 70 years"
- Person: "age"